PI deems unfit to participate

The above is a clinical trial exclusion criterion. Annotated with entity spans:
[Non-query-able: PI deems unfit to participate]